Need for dual organ transplant

The above is a clinical trial exclusion criterion. Annotated with entity spans:
[Mood: Need for] [Procedure: dual organ transplant]